下列何項特性可見於急性巨核細胞白血病（acute megakaryoblastic leukemia）？
A. peroxidase 陽性反應
B. 細胞質內出現 Auer rod
C. 表現 Glycophorin A
D. 表現 CD41

正確答案：D. 表現 CD41